有關於細胞訊息傳遞之機轉，下列何者錯誤？
A. 脂溶性ligand可以直接穿越細胞膜，並且與細胞內receptor結合產生作用
B. 有些transmembrane receptor 本身即具有酵素活性，可以經由與ligand結合後活化
C. 有些transmembrane receptor與ligand結合後，可以活化protein tyrosine kinase
D. NMDA glutamate receptor屬於GPCR（G-protein coupled receptor）

正確答案：D. NMDA glutamate receptor屬於GPCR（G-protein coupled receptor）